Clinical trial exclusion criterion:
10. Chronic infections including, but not limited to tuberculosis (TB), hepatitis B virus (HBV) or hepatitis C virus (HCV).

Annotated entities:
- Parsing_Error: "10."
- Condition: "tuberculosis (TB)"
- Condition: "hepatitis B virus (HBV)"
- Condition: "hepatitis C virus (HCV)"
- Condition: "infections"
- Multiplier: "Chronic"